Clinical trial exclusion criterion:
Bilateral total knee arthroplasty

Annotated entities:
- Procedure: "Bilateral total knee arthroplasty"